Clinical trial exclusion criterion:
Known severe renal insufficiency

Annotated entities:
- Condition: "renal insufficiency"
- Qualifier: "severe"